Clinical trial inclusion criterion:
Capable of giving informed consent and complying with study procedures

Annotated entities:
- Non-query-able: "Capable of giving informed consent and complying with study procedures"